14. Statins: simvastatin, fluvastatin, rosuvastatin at doses greater than 10 mg/d, atorvastatin at doses greater than 10 mg/d.

The above is a clinical trial exclusion criterion. Annotated with entity spans:
[Parsing_Error: 14.] Statins: [Drug: simvastatin], [Drug: fluvastatin], [Drug: rosuvastatin] at [Multiplier: doses greater than 10 mg/d], [Drug: atorvastatin] at [Multiplier: doses greater than 10 mg/d].